Clinical trial exclusion criterion:
has a history of food allergy

Entity relations:
- Has_temporal("food allergy", "history")